Clinical trial inclusion criterion:
Newly diagnosed or without steroid use during last 1 year

Entity relations:
- Has_temporal("steroid", "during last 1 year")
- Has_negation("steroid", "without")